Clinical trial exclusion criterion:
6. Patients with moderately severe mental disease

Entity relations:
- Has_qualifier("mental disease", "moderately severe")